一位 60 歲的女性被家人帶來看診，症狀為一年半以來，交談中常常找不出適當的字語，有時以替代字充數，有時則大發脾氣，日常記憶力還好，生活功能也尚能自主。身體診查發現運動、感覺、平衡、自主神經系統都正常。這位女性最有可能的情況為：
A. 原發性漸行性失語症（primary progressive aphasia）
B. 路易氏體失智症（dementia with Lewy bodies）
C. 庫賈氏症（Creutzfeldt-Jakob disease）
D. 急性左側中大腦動脈（middle cerebral artery）阻塞

正確答案：A. 原發性漸行性失語症（primary progressive aphasia）